18 歲女性至門診主訴頸部腫塊反覆發炎約一年，經診視發現頸部中線舌骨下方有一 2 公分囊腫隨吞嚥動作上下移動，請問以下敘述何者錯誤？
A. 此囊腫為最常見之先天性頸部囊腫
B. 手術治療多採用「Sistrunk」手術
C. 需排除異位甲狀腺之可能以免誤切唯一之甲狀腺
D. 常有惡性變化需儘早切除

正確答案：D. 常有惡性變化需儘早切除